一位 4 個月大女嬰曾經罹患 4 次皮膚膿瘍（abscess），這次又因屁股（buttock）有個膿瘍住院。照顧她的外婆說此女嬰臍帶比其他外孫晚 3 週才掉，而且有發生臍帶感染，您認為下列何種檢驗最能確診此病？
A. IgG subclass
B. Lymphocyte subsets
C. Mitogen response test
D. CD11/CD18 expression on flow cytometry

正確答案：D. CD11/CD18 expression on flow cytometry